La región de la corteza cerebral que selecciona la estrategia más adecuada para ejecutar un movimiento en función de la experiencia y toma la decisión de iniciar el movimiento es:
1. El área motora primaria.
2. La corteza prefrontal ventromedial.
3. La corteza prefrontal dorsolateral.
4. La corteza inferotemporal.

Respuesta correcta: 3. La corteza prefrontal dorsolateral.